Clinical trial exclusion criterion:
Known renovascular hypertension or evidence of pulmonary hypertension (pulmonary vascular resistance > 6 Wood units) unresponsive to vasodilator agents such as oxygen, nitroprusside, or nitric oxide

Annotated entities:
- Condition: "renovascular hypertension"
- Condition: "pulmonary hypertension"
- Mood: "evidence of"
- Measurement: "pulmonary vascular resistance"
- Value: "> 6 Wood units"
- Qualifier: "unresponsive to vasodilator agents"
- Drug: "vasodilator agents"
- Drug: "oxygen"
- Drug: "nitroprusside"
- Drug: "nitric oxide"